Which are the databases for intrinsic protein disorders?

Intrinsic disorder (ID), i.e. the lack of a unique folded conformation at physiological conditions, is a common feature for many proteins, which requires specialized biochemical experiments that are not high-throughput. DisProt and MobiDB are databases for intrinsic protein disorders.